下列何種腸胃道息肉（Polyps）發生大腸癌（Colon cancer）的風險最高？
A. 幼年性息肉症（Juvenile polyposis）
B. 家族性結直腸息肉症（Familial adenomatous polyposis）
C. Peutz-Jeghers症候群（Peutz-Jeghers syndrome）
D. Cowden症候群（Cowden syndrome）

正確答案：B. 家族性結直腸息肉症（Familial adenomatous polyposis）